Clinical trial inclusion criterion:
Patient over 18 years weighing between 65 and 85 Kg

Annotated entities:
- Person: "years"
- Value: "over 18"
- Measurement: "weighing"
- Value: "between 65 and 85 Kg"